Women with active thromboembolic disorders

The above is a clinical trial exclusion criterion. Annotated with entity spans:
[Person: Women] with [Qualifier: active] [Condition: thromboembolic disorders]